Clinical trial exclusion criterion:
Patients undergoing total hip or knee replacement who have been enrolled in this study for a prior hip or knee replacement;

Entity relations:
- OR("total hip replacement", "total knee replacement")